Clinical trial inclusion criterion:
Patient who had been diagnosed within the previous 12 months with HbA1c levels of 8.0-12.0%, did not have a medical history related to diabetes, and did not display proliferative retinopathy

Entity relations:
- Has_value("HbA1c", "8.0-12.0%")
- Has_temporal("HbA1c", "previous 12 months")
- Has_negation("proliferative retinopathy", "not")
- Has_negation("medical history related to diabetes", "not")